Clinical trial exclusion criterion:
30 min or more of moderate to vigorous activity more than 3 times per week

Annotated entities:
- Observation: "moderate to vigorous activity"
- Multiplier: "more than 3 times per week"
- Multiplier: "30 min or more"